MRI showing no skip lesion

The above is a clinical trial inclusion criterion. Annotated with entity spans:
[Procedure: MRI] showing [Negation: no] [Observation: skip lesion]